Clinical trial exclusion criterion:
Current or past (within the last 5 years) malignant neoplasms (except basal cell and squamous cell skin carcinoma)

Annotated entities:
- Condition: "malignant neoplasms"
- Temporal: "Current"
- Temporal: "past"
- Temporal: "within the last 5 years"
- Condition: "basal cell carcinoma"
- Condition: "squamous cell skin carcinoma"
- Negation: "except"